下列病毒的特性，何者不正確？
A. 病毒複製之方法是由"分裂＂完成
B. 病毒之基因體為 DNA 或 RNA
C. 病毒可依套膜之有無作分類
D. 病毒必須在宿主細胞內進行複製

正確答案：A. 病毒複製之方法是由"分裂＂完成